下列何種先天性心臟病，不會在胸部 X 光片中呈現肺血管紋路增加（increased pulmonary vascularity）？
A. 心房中隔缺損（atrial septal defect）
B. 動脈導管開放症（patent ductus arteriosus）
C. 法洛氏四重畸型（tetralogy of Fallot）
D. 大血管轉位症（transposition of great arteries）

正確答案：C. 法洛氏四重畸型（tetralogy of Fallot）